Mini-Mental status examination = 24

The above is a clinical trial inclusion criterion. Annotated with entity spans:
[Measurement: Mini-Mental status examination] [Value: = 2]4